Rickettsia felis was described as a human pathogen almost two decades ago, what is it's main arthropod vector?

Cat fleas (Ctenocephalides felis) carrying Rickettsia felis and Bartonella species in Hong Kong.